La secreción de GH u hormona de crecimiento:
1. Cesa hacia los 20 años.
2. Dura toda la vida.
3. Durante el día es mayor que por la noche.
4. La estimula la somatostatina.
5. La estimulan las sometomedinas.

Respuesta correcta: 2. Dura toda la vida.